Clinical trial exclusion criterion:
inability to tolerate small, enclosed spaces without anxiety (e.g. claustrophobia), as determined by self-report and/or a preliminary session in a mock scanner

Entity relations:
- Has_negation("tolerate small, enclosed spaces without anxiety", "inability")
- multi("inability", "inability")
- Subsumes("tolerate small, enclosed spaces without anxiety", "claustrophobia")
- AND("tolerate small, enclosed spaces without anxiety", "self-report")